一位 21 歲的張姓學生全身無力無法起床，被送至急診室求診。他說昨天去爬山還健步如飛，回來後與同學去吃大餐時精神還很好。他兩個星期前有一次參加朋友的生日舞會，隔天也是全身無力。理學檢查發現他全身肌肉無力，肌腱反射（tendon reflexes）消失，但沒有肌肉萎縮或感覺異常的情形。 張同學的狀況與血液中下列那一個電解質最有關係？
A. 鈣離子
B. 鈉離子
C. 鉀離子
D. 氯離子

正確答案：C. 鉀離子